何者為此 DNA 序列的互補股：5'-CGCGAATTCGCG-3'？
A. 5'-GCGCTTAAGCGC-3'
B. 5'-CGCGAATTCGCG-3'
C. 5'-GCGCUUAAGCGC-3'
D. 5'-CGCGAAUUCGCG-3'

正確答案：B. 5'-CGCGAATTCGCG-3'